下列何種義足屬於儲能型義足（energy storage foot）？
A. 單軸義足（single axis foot）
B. 多軸義足（multiple axis foot）
C. 費式義足（Flex foot）
D. 沙奇式義足（SACH foot）

正確答案：C. 費式義足（Flex foot）